1. Must have given written informed consent (signed and dated) and any authorizations required by local law

The above is a clinical trial inclusion criterion. Annotated with entity spans:
[Parsing_Error: 1.] [Post-eligibility: Must have given written informed consent (signed and dated) and any authorizations required by local law]